當人體的呼吸道暴露在有過敏原的環境時，會產生早期支氣管攣縮反應（early bronchospastic response），導致氣喘病的急性發作，其主要原因為：
A. 化學激素（chemokine）分泌引致嗜伊紅性白血球的趨化作用（chemotaxis）
B. 第一型輔助細胞（TH1 cells）產生介白質-2（interleukin-2）及丙型干擾素（interferon-gamma）
C. 肥胖細胞（mast cells）分泌組織胺（histamine）及白三烯素（leukotriene）
D. 呼吸道杯狀細胞增生（goblet cell hyperplasia）及黏液積滯（mucus plug）

正確答案：C. 肥胖細胞（mast cells）分泌組織胺（histamine）及白三烯素（leukotriene）